嘌呤的代謝異常會導致人類疾病，下列關於 adenosine deaminase（ADA）deficiency 的敘述何者錯誤？
A. ADA 缺乏時會導致嚴重的免疫缺乏，讓 T 淋巴球無法發揮正常防禦功能
B. ADA 缺乏時會促進 dATP 的合成
C. ADA 缺乏時會導致細胞中累積 100 倍以上的 dATP
D. 細胞中過多的 dATP 會抑制核酸還原的作用，而無法產生其他的 dNTP

正確答案：B. ADA 缺乏時會促進 dATP 的合成